Clinical trial exclusion criterion:
Immunization with any other vaccine (oral or parenteral) within 4 weeks prior to study start or planned vaccination during the study

Entity relations:
- Has_qualifier("Immunization with vaccine", "any other")
- Has_qualifier("Immunization with vaccine", "oral")
- Has_index("within 4 weeks prior to study start", "study start")
- Has_temporal("Immunization with vaccine", "within 4 weeks prior to study start")
- Has_mood("vaccination", "planned")
- Has_temporal("vaccination", "during the study")
- Has_index("during the study", "the study")
- OR("oral", "parenteral")
- OR("Immunization with vaccine", "vaccination")